Clinical trial exclusion criterion:
Evident local or pelvic recurrence

Entity relations:
- OR("local recurrence", "pelvic recurrence")